Clinical trial inclusion criterion:
selective operation of inguinal hernia repair<U+3001>orthopedics operation or general surgery operation in children

Annotated entities:
- Procedure: "inguinal hernia repair"
- Procedure: "orthopedics operation"
- Procedure: "general surgery operation"
- Person: "children"